Medullary thyroid carcinoma (MTC) or Multiple Endocrine Neoplasia Syndrome Type 2 (MEN 2)

The above is a clinical trial exclusion criterion. Annotated with entity spans:
[Condition: Medullary thyroid carcinoma] ([Condition: MTC]) or [Condition: Multiple Endocrine Neoplasia Syndrome Type 2] ([Condition: MEN 2])